Clinical trial exclusion criterion:
Allergy to study medication

Annotated entities:
- Condition: "Allergy"
- Drug: "study medication"